樹突細胞所分泌的細胞激素會影響CD4+ T細胞之分化，下列那些細胞激素會刺激第十七型輔助性T 細胞（TH17）之分化？
A. TGF-β，IL-6 及 IL-10
B. TGF-β 及 IL-10
C. IL-10 及 IL-6
D. TGF-β 及 IL-6

正確答案：D. TGF-β 及 IL-6